Clinical trial exclusion criterion:
Known secondary causes (genetic, endocrine, or metabolic) for obesity (eg, Prader-Willi syndrome, Bardet Biedl syndrome, Down's Syndrome, untreated hypothyroidism, Cushing's syndrome, daily systemic corticosteroid exposure for longer than 30 days, history of significant exposure to corticosteroids for chronic illness during the past year; inhaled steroids will be allowed)

Entity relations:
- Has_qualifier("secondary causes for obesity", "genetic")
- Has_multiplier("systemic corticosteroid", "daily")
- Has_temporal("systemic corticosteroid", "for longer than 30 days")
- AND("corticosteroids", "chronic illness")
- Has_temporal("corticosteroids", "during the past year")
- Has_qualifier("corticosteroids", "significant exposure")
- Has_temporal("corticosteroids", "history")
- Subsumes("secondary causes for obesity", "Prader-Willi syndrome")
- OR("genetic", "endocrine", "metabolic")
- OR("Prader-Willi syndrome", "corticosteroids", "Cushing's syndrome", "untreated hypothyroidism", "Down's Syndrome", "Bardet Biedl syndrome", "systemic corticosteroid")